Clinical trial inclusion criterion:
full term singleton pregnant women

Annotated entities:
- Qualifier: "singleton"
- Condition: "pregnant"
- Qualifier: "full term"
- Person: "women"